Clinical trial exclusion criteria:
pregnant or breastfeeding
known thromboembolic disease or with high risk of thromboembolism, warranting extra anticoagulation in connection with the procedure
known allergy to tranexamic acid/Cyklokapron®

Annotated entities:
- Condition: "pregnant"
- Observation: "breastfeeding"
- Condition: "thromboembolic disease"
- Mood: "high risk of"
- Condition: "thromboembolism"
- Procedure: "extra anticoagulation"
- Condition: "allergy"
- Drug: "tranexamic acid"
- Drug: "Cyklokapron"